Clinical trial inclusion criterion:
signed informed consent before PCI.

Annotated entities:
- Informed_consent: "signed informed consent before PCI"